懷孕時診斷出患有子宮頸癌，則下列何者正確？
A. 預後和非孕婦相同
B. 若懷孕 17 週發現子宮頸癌，應等胎兒成熟再處理
C. 陰道生產一定會惡化預後
D. 放射線治療不會引起流產

正確答案：A. 預後和非孕婦相同